一位28歲的男性病人，最近一週每天晚上會發生劇烈頭痛，每次頭痛都發生在右邊眼眶和太陽穴的地方，同時也有右邊眼睛紅和流淚的現象，大約一個小時後就會緩解，他去年秋天的時候也有一個月的時間天天晚上發生類似的頭痛。下列何者為最可能的診斷？
A. 叢發性頭痛（cluster headache）
B. 預兆偏頭痛（migraine with aura）
C. 腦瘤
D. 青光眼（glaucoma）

正確答案：A. 叢發性頭痛（cluster headache）